有關類過敏性紫斑症（Henoch-Schönlein Purpura）的敘述，下列何者最為適切？
A. 是一個以IgE為主的過敏反應
B. 大多數病人需使用類固醇治療
C. 因有皮膚的症狀，須局部治療
D. 注意是否合併腹痛、關節痛、血尿

正確答案：D. 注意是否合併腹痛、關節痛、血尿